Clinical trial inclusion criterion:
Available for all visits scheduled in this study.

Entity relations:
- Has_qualifier("Available for all visits", "scheduled in this study")